Dandy-Walker malformation是屬於一種小兒先天性水腦症，下列何者最早產生擴大現象？
A. 第三腦室（3rd ventricle）
B. 第四腦室（4th ventricle）
C. 大腦導水管（aqueduct）
D. 側腦室（lateral ventricle）

正確答案：B. 第四腦室（4th ventricle）